Clinical trial exclusion criterion:
Fetal destress or gestational age < 36 week

Annotated entities:
- Condition: "Fetal destress"
- Measurement: "gestational age"
- Value: "< 36 week"